Clinical trial exclusion criterion:
Inability to physically tolerate MRI or implanted objects that are MRI incompatible

Annotated entities:
- Condition: "Inability to physically tolerate"
- Procedure: "MRI"
- Device: "implanted objects"
- Qualifier: "MRI incompatible"